Aged =18 years

The above is a clinical trial inclusion criterion. Annotated with entity spans:
[Person: Aged] [Value: =18 years]